Clinical trial exclusion criterion:
Patient currently included in a study of varicose vein treatment

Annotated entities:
- Competing_trial: "Patient currently included in a study of varicose vein treatment"